Clinical trial inclusion criteria:
Stage 3 - 5 Chronic Kidney Disease

Annotated entities:
- Condition: "Chronic Kidney Disease"
- Measurement: "Stage"
- Value: "3 - 5"